Clinical trial exclusion criterion:
Central nervous system (CNS) infections or opportunistic conditions: brain abscess (bacterial, mycobacterial, fungal or Toxoplasma), meningitis with persistent neurologic impairment, primary CNS lymphoma, progressive multifocal leukoencephalopathy (PML), or another structural brain lesion with neurological sequelae

Entity relations:
- Has_multiplier("neurologic impairment", "persistent")
- AND("meningitis", "neurologic impairment")
- Has_qualifier("brain abscess", "bacterial")
- AND("structural brain lesion", "neurological sequelae")
- Has_qualifier("structural brain lesion", "another")
- Subsumes("Central nervous system (CNS) infections", "brain abscess")
- Has_qualifier("CNS lymphoma", "primary")
- OR("Central nervous system (CNS) infections", "Central nervous system (CNS) opportunistic conditions")
- OR("bacterial", "fungal", "mycobacterial", "Toxoplasma")
- OR("brain abscess", "progressive multifocal leukoencephalopathy (PML)", "CNS lymphoma", "meningitis", "structural brain lesion")